Una mujer de 34 años ingresa en el hospital por una embolia pulmonar confirmada mediante angio-TC. No tiene antecedentes de cirugía reciente, traumatismos o viajes. Refiere fenómeno de Raynaud desde hace 2 años, y el año anterior tuvo un aborto a las 12 semanas de gestación. No tiene historia familiar de enfermedad tromboembólica venosa. El tiempo de tromboplastina parcial activado es de 56 sg (normal 25-35 sg) y la cifra de plaquetas de 120000/uL. ¿Cuál de las siguientes pruebas diagnósticas le ayudaría más en el diagnóstico?
1. Antitrombina III.
2. Anticoagulante lúpico.
3. Factor V de Leiden.
4. Proteína C.
5. Proteína S.

Respuesta correcta: 2. Anticoagulante lúpico.